下列何者不是腰神經叢的分支？
A. 髂腹下神經（iliohypogastric nerve）
B. 髂腹股溝神經（ilioinguinal nerve）
C. 後股皮神經（posterior femoral cutaneous nerve）
D. 閉孔神經（obturator nerve）

正確答案：C. 後股皮神經（posterior femoral cutaneous nerve）